What is the role of metalloproteinase-17 (ADAM17) in NK cells?

The metalloproteinase-17 (ADAM17) is involved in CD16A cleavage and acts as a regulatory checkpoint in NK cells